Patients undergoing surgery on shoulder, humerus, or clavicle

The above is a clinical trial inclusion criterion. Annotated with entity spans:
Patients undergoing [Procedure: surgery] on [Qualifier: shoulder], [Qualifier: humerus], or [Qualifier: clavicle]